Clinical trial inclusion criterion:
10. Willing to refrain from use of vaginal products or objects within 14 days prior to enrollment and for the duration of the study

Entity relations:
- multi("for the duration of the study", "the study")
- multi("within 14 days prior to enrollment", "enrollment")
- Has_mood("vaginal products", "Willing")
- Has_temporal("vaginal products", "within 14 days prior to enrollment")
- Has_temporal("vaginal products", "for the duration of the study")
- Has_negation("vaginal products", "refrain")
- OR("vaginal products", "objects vaginal")